一位慢性阻塞性肺病（COPD）病患，因急性惡化（acute exacerbation）被送至急診，下列關於此病患治療之敘述，何者為非？
A. 短效性吸入型乙二型交感神經興奮劑（β2-agonist）與吸入型抗乙醯膽鹼製劑（anticholinergics）為主要使用之支氣管擴張劑
B. 短期之口服或靜脈注射類固醇（glucocorticosteroids）對此種病患而言，並無縮短病程，加速肺功能改善之效果
C. 病患急性惡化之原因若是呼吸道感染，應選用可對抗 S. pneumoniae, H. influenzae 及 M. catarrhalis 之抗生素
D. 非侵襲性陽壓呼吸器（NIPPV）能改善此病患之呼吸衰竭，減少氣管內管插管率及減低死亡率

正確答案：B. 短期之口服或靜脈注射類固醇（glucocorticosteroids）對此種病患而言，並無縮短病程，加速肺功能改善之效果